Clinical trial exclusion criterion:
18. Prior treatment with B cell or lymphocyte-depleting agents (eg, rituximab, Campath)

Annotated entities:
- Parsing_Error: "18."
- Drug: "B cell -depleting agents"
- Drug: "lymphocyte-depleting agents"
- Drug: "rituximab"
- Drug: "Campath"
- Temporal: "Prior"